Clinical trial inclusion criterion:
(3)If a study participant is a woman of childbearing age, she agrees to use a reliable contraceptive method during the trial;

Entity relations:
- Has_qualifier("contraceptive method", "reliable")
- Has_temporal("contraceptive method", "during the trial")
- Has_index("during the trial", "the trial")
- Has_context("woman", "contraceptive method")
- Has_mood("contraceptive method", "agrees to use")
- Has_context("childbearing age", "contraceptive method")